Clinical trial exclusion criterion:
Previously enrolled in this study (i.e. patient now at repeat encounter)

Entity relations:
- Has_temporal("enrolled in this study", "Previously")